Clinical trial exclusion criterion:
Impact on overall severe (grade 3 or 4 of the WHO scale) not attributable to the LAL

Annotated entities:
- Non-representable: "Impact on overall severe (grade 3 or 4 of the WHO scale) not attributable to the LAL"